Clinical trial exclusion criterion:
2. History of disabling neurological or psychiatric condition such as epilepsy (besides posttraumatic epilepsy), multiple sclerosis, cortical stroke, hypoxic-ischemic encephalopathy, encephalitis, or schizophrenia

Entity relations:
- Has_negation("posttraumatic epilepsy", "besides")
- AND("epilepsy", "posttraumatic epilepsy")
- Has_temporal("psychiatric condition disabling", "History")
- Subsumes("psychiatric condition disabling", "epilepsy")
- OR("epilepsy", "encephalitis", "hypoxic-ischemic encephalopathy", "cortical stroke", "multiple sclerosis", "schizophrenia")
- OR("psychiatric condition disabling", "condition disabling neurological")